某職業病醫師想探討工廠勞工吃檳榔和口腔疾病可能的相關性，他在某工廠內問了每個工人是否有吃檳榔的習慣，同時請一個牙醫檢查口腔疾病，請問這是一個什麼樣的研究？
A. 個案對照研究（case-control study）
B. 橫斷研究（cross-sectional study）
C. 臨床試驗研究（clinical trial）
D. 世代研究（cohort study）

正確答案：B. 橫斷研究（cross-sectional study）